Clinical trial inclusion criteria:
1. Patients ≥ 18 years-old from "Instituto Teletón Santiago" and "Hospital Clínico Mutual de seguridad".
2. C5 to T12 spinal cord injury, classified as ISNCSCI grades C and D
3. Traumatic and non-traumatic, non-progressive lesions
4. Onset > 6 months
5. Ability to ambulate with or without assistive devices
6. Ability to follow verbal or visual commands
7. Signed informed consent

Annotated entities:
- Parsing_Error: "1."
- Value: "≥ 18 years"
- Person: "years-old"
- Visit: "Instituto Teletón Santiago"
- Visit: "Hospital Clínico Mutual de seguridad"
- Grammar_Error: "and"
- Parsing_Error: "2."
- Condition: "spinal cord injury"
- Qualifier: "C5 to T12"
- Measurement: "ISNCSCI"
- Value: "grades C and D"
- Parsing_Error: "3."
- Qualifier: "non-traumatic"
- Condition: "lesions"
- Qualifier: "Traumatic"
- Qualifier: "non-progressive"
- Parsing_Error: "4."
- Temporal: "Onset > 6 months"
- Parsing_Error: "5."
- Condition: "Ability to ambulate with assistive devices"
- Condition: "Ability to ambulate without assistive devices"
- Parsing_Error: "6."
- Condition: "Ability to follow verbal commands"
- Condition: "Ability to follow visual commands"
- Parsing_Error: "7."
- Post-eligibility: "Signed informed consent"
- Non-query-able: "Signed informed consent"